Written, voluntary informed consent.

The above is a clinical trial inclusion criterion. Annotated with entity spans:
[Post-eligibility: Written, voluntary informed consent.]